Documented life expectancy of less than 12 months

The above is a clinical trial exclusion criterion. Annotated with entity spans:
Documented [Observation: life expectancy] of [Value: less than 12 months]